當一基因的 3' untranslated region（3' UTR）的 AATAAA 突變為 AAGAAA 時，其導致的缺陷為影響核糖核酸（RNA）合成後的那一步驟？
A. 端帽步驟（capping）
B. 多聚腺苷化作用（polyadenylation）
C. 剪接作用（splicing）
D. 運輸（transport）

正確答案：B. 多聚腺苷化作用（polyadenylation）